Clinical trial inclusion criterion:
Subject must have a diagnosis of COPD based on the American Thoracic Society (ATS)/ European Respiratory Society (ERS) criteria.

Entity relations:
- AND("COPD", "American Thoracic Society (ATS)/ European Respiratory Society (ERS) criteria")